Clinical trial exclusion criterion:
Allergy to any of the drugs used in the study

Annotated entities:
- Condition: "Allergy"
- Drug: "drugs used in the study"